Clinical trial exclusion criterion:
A history of substance abuse and/or dependence.

Annotated entities:
- Condition: "substance abuse"
- Condition: "substance dependence"